一位 65 歲女性，因為頭痛、眼痛且視力突然模糊而就醫，經診斷為急性青光眼，必須接受降低眼壓的治療。病人的過去病史包括高血壓及氣喘，此外心臟、肝臟及腎臟的功能都正常，也沒有藥物過敏的情況。在給與降壓治療時，下列何者最應避免使用？
A. Intravenous mannitol infusion
B. Oral acetazolamide
C. Pilocarpine eye drop
D. Beta-adrenergic antagonist eye drop

正確答案：D. Beta-adrenergic antagonist eye drop